Disease limited to the liver Unresectable disease by surgery or other local therapies

The above is a clinical trial inclusion criterion. Annotated with entity spans:
[Observation: Disease limited to the liver] [Condition: Unresectable disease] by [Procedure: surgery] or [Qualifier: other] [Procedure: local therapies]